What is the purpose of the 123 dihydrorhodamine assay?

Dihydrorhodamine assay (DRB) is a simple, reliable, and valid method for studying oxidative stress, in particular oxidative stress and reactive oxygen species.